Clinical trial inclusion criterion:
women and men between 18 - 80 years of age

Annotated entities:
- Person: "women"
- Person: "men"
- Person: "age"
- Value: "between 18 - 80 years"